Locally advanced disease as determined by endoscopic ultrasound (EUS) stage > primary tumor (T) 3 and/or any T, lymph nodes (N)+ disease without metastatic disease (Mx)

The above is a clinical trial inclusion criterion. Annotated with entity spans:
[Qualifier: Locally advanced] [Condition: disease] as determined by [Procedure: endoscopic ultrasound] ([Procedure: EUS]) stage [Value: > primary tumor (T) 3 and/or any T, lymph nodes (N)+ disease without metastatic disease (Mx)]